Known or suspected allergy to octreotide

The above is a clinical trial exclusion criterion. Annotated with entity spans:
[Mood: Known] or [Mood: suspected] [Condition: allergy] to [Drug: octreotide]